Cholecystectomy.

The above is a clinical trial exclusion criterion. Annotated with entity spans:
[Procedure: Cholecystectomy].